廣泛新血管生成（angiogenesis）不會發生在：
A. 黃體生成
B. 胚胎生成
C. 惡性腫瘤
D. 皮樣囊腫（dermoid cyst）

正確答案：D. 皮樣囊腫（dermoid cyst）